=2 risk factors: diabetes mellitus, age =70 years, BMI =30, fascial enlargement

The above is a clinical trial inclusion criterion. Annotated with entity spans:
[Multiplier: =2] [Condition: risk factors]: [Condition: diabetes mellitus], [Person: age] [Value: =70 years], [Measurement: BMI] [Value: =30], [Condition: fascial enlargement]